Clinical trial exclusion criterion:
Triglycerides =500 mg/dL

Annotated entities:
- Measurement: "Triglycerides"
- Value: "=500 mg/dL"